fibrin-specific fibrinolytic therapy less than 24 h before randomization, non-fibrin-specific fibrinolytic therapy less than 48 h before randomization

The above is a clinical trial inclusion criterion. Annotated with entity spans:
[Qualifier: fibrin-specific] [Procedure: fibrinolytic therapy] [Temporal: less than 24 h before randomization], [Qualifier: non-fibrin-specific] [Procedure: fibrinolytic therapy] [Temporal: less than 48 h before randomization]